Competent to provide informed consent

The above is a clinical trial inclusion criterion. Annotated with entity spans:
[Informed_consent: Competent to provide informed consent]